History of taking coumadin or similar anticoagulant, have a known coagulopathy, bleeding dyscrasia, or platelet count < 150,000/cubic mm

The above is a clinical trial exclusion criterion. Annotated with entity spans:
History of taking [Drug: coumadin] or similar [Drug: anticoagulant], have a known [Condition: coagulopathy], [Condition: bleeding dyscrasia], or [Measurement: platelet count] [Value: < 150,000/cubic mm]